乳癌病患接受改良式根治性乳房切除術（modified radical mastectomy）後，發生肩胛畸形（winged scapula deformity），表示下列何神經受損？
A. 胸背神經（thoracodorsal nerve）
B. 長胸神經（long thoracic nerve）
C. 內胸神經（medial pectoral nerve）
D. 肋間臂神經（intercostal brachial nerve）

正確答案：B. 長胸神經（long thoracic nerve）